Contraindications to exposure to a magnetic field

The above is a clinical trial exclusion criterion. Annotated with entity spans:
[Condition: Contraindications] to exposure to a [Device: magnetic field]